Clinical trial exclusion criterion:
have a residual limb length which does not allow for seven inches clearance of bracket attachment for the PowerFoot

Annotated entities:
- Measurement: "residual limb length"
- Value: "does not allow for seven inches clearance of bracket attachment"
- Negation: "does not"